Clinical trial exclusion criterion:
Assessed by the investigator to be unable or unwilling to comply with the requirements of the protocol.

Entity relations:
- OR("unable to comply with the requirements of the protocol", "unwilling to comply with the requirements of the protocol")